下列有關乳房切除後重建（Postmastectomy breast reconstruction）之敘述，何者錯誤？
A. 減輕病人的殘缺感
B. 立即重建可減少心理創傷
C. 會延遲乳癌再發之偵測
D. 立即重建會延後後續之化學治療，對較晚發現的乳癌患者並不適合

正確答案：C. 會延遲乳癌再發之偵測